關於睡眠呼吸中止症（sleep apnea）的敘述，下列何者錯誤？
A. 呼吸中止（apnea）可以發生在非快速動眼期（NREM）或快速動眼期（REM）睡眠，通常非快速動眼期較常發生呼吸中止，而發生在快速動眼期則較嚴重
B. 選擇性血清素再吸收抑制劑（SSRI）治療呼吸中止症是藉由減少快速動眼期睡眠所致
C. 早期認為阻塞型（obstructive）呼吸中止症較常抱怨白天嗜睡，中樞型（central）呼吸中止症較常抱怨失眠，近年研究發現嗜睡或失眠症狀均可發生在此2類型的呼吸中止症
D. 持續性呼吸道正壓儀器（CPAP）是用來治療中樞型呼吸中止症

正確答案：D. 持續性呼吸道正壓儀器（CPAP）是用來治療中樞型呼吸中止症